¿Cuál de los siguientes procesos celulares da lugar a radicales libres como defensa natural de los neutrófilos frente a bacterias?:
1. Apoptosis.
2. Necrosis.
3. Fagocitosis e inflamación.
4. Autofagia.

Respuesta correcta: 3. Fagocitosis e inflamación.